What are Syndecans?

Syndecans are transmembrane proteoglycans that, together with integrins, control cell interactions with extracellular matrix components.